Clinical trial exclusion criterion:
Hospital admission for protein losing enteropathy or plastic bronchitis within 3 months of randomization

Entity relations:
- AND("Hospital admission", "protein losing enteropathy")
- Has_temporal("Hospital admission", "within 3 months of randomization")
- Has_index("within 3 months of randomization", "randomization")
- OR("protein losing enteropathy", "plastic bronchitis")